How are looped genes identified in yest?

gene-loop formation is dependent on regulatory proteins localized at the 5' and 3' ends of genes, such as tfiib.